Clinical trial inclusion criterion:
Have an indication for induction or attempted induction of labor according to Parkland protocol

Annotated entities:
- Condition: "indication"
- Procedure: "induction of labor"
- Qualifier: "attempted"
- Procedure: "Parkland protocol"
- Procedure: "induction"